Less than 24 hours since bite, AND

The above is a clinical trial inclusion criterion. Annotated with entity spans:
[Temporal: Less than 24 hours since bite], AND